醫學研究中對於以兒童、孕婦、囚犯、精神病患為受試者的研究皆有比較嚴格的規範，主要是基於何種考量？
A. 這類受試者人數有限
B. 代理同意須嚴格把關
C. 對易受傷害受試族群的保護
D. 這些人參與試	的風險過高

正確答案：C. 對易受傷害受試族群的保護